Clinical trial exclusion criterion:
previous chemotherapy

Annotated entities:
- Temporal: "previous"
- Procedure: "chemotherapy"